下列何種處置不建議用來降低腦壓（intracranial pressure）？
A. 頭抬高30度
B. 過度換氣（hyperventilation）使二氧化碳分壓（PaCO2）降低到20 mmHg
C. 低溫（hypothermia）治療
D. 腦室引流腦脊髓液（ventricular CSF drainage）

正確答案：B. 過度換氣（hyperventilation）使二氧化碳分壓（PaCO2）降低到20 mmHg